Use of antipsychotics or mood stabilizers within 5 days prior to screening.

The above is a clinical trial exclusion criterion. Annotated with entity spans:
Use of [Drug: antipsychotics] or [Drug: mood stabilizers] [Temporal: within 5 days prior to screening].